Una persona cuyo grupo sanguíneo es A negativo:
1. Puede recibir una transfusión de sangre del tipo AB.
2. Tiene el antígeno B en sus células.
3. Tiene el antígeno A en sus células.
4. Tiene anticuerpos (aglutininas) anti-A en el plasma.

Respuesta correcta: 3. Tiene el antígeno A en sus células.